李先生，28 歲，因公務需要奉派到尼泊爾 3 個月，因尼泊爾為 A 肝盛行區，下列對李先生之建議何者錯誤？
A. 避免生食及飲用未煮沸的水
B. 保持良好衛生習慣，確實洗手
C. 抽血檢驗 A 肝抗原，若無帶原，可施打 A 肝疫苗
D. 可注射 A 型肝炎免疫球蛋白，作被動免疫

正確答案：C. 抽血檢驗 A 肝抗原，若無帶原，可施打 A 肝疫苗